Clinical trial inclusion criterion:
Life expectancy > 3 months.

Entity relations:
- Has_value("Life expectancy", "> 3 months")